Clinical trial exclusion criterion:
Office or average home SBP > 180 mm Hg or DBP > 110 mm Hg (Average home BP in any seven day period during trial)

Entity relations:
- Has_value("DBP", "> 110 mm Hg")
- Has_value("SBP", "> 180 mm Hg")
- OR("SBP", "DBP")